Participation in any clinical investigation within 4 weeks prior to dosing or longer if required by local regulation.

The above is a clinical trial exclusion criterion. Annotated with entity spans:
Participation in [Competing_trial: any clinical investigation] [Temporal: within 4 weeks prior to dosing] or longer if required by local regulation.